Decompensated heart failure or hemodynamic instability

The above is a clinical trial exclusion criterion. Annotated with entity spans:
[Qualifier: Decompensated] [Condition: heart failure] or [Condition: hemodynamic instability]